下列何者之血管形成臍動脈和臍靜脈？
A. 羊膜（amnion）
B. 絨毛膜（chorion）
C. 卵黃囊（yolk sac）
D. 尿囊（allantois）

正確答案：D. 尿囊（allantois）